下列有關沙狀病毒（Arenavirus）之敘述，何者正確？
A. 以節肢動物為媒介而傳播之
B. 感染腸胃道
C. 以齧齒動物為媒介的 RNA 病毒
D. 以狗為媒介而傳播之 	-

正確答案：C. 以齧齒動物為媒介的 RNA 病毒